Forced expiratory volume/Forced vital capacity (FEV1 / FVC) > 70% of predicted;

The above is a clinical trial inclusion criterion. Annotated with entity spans:
[Measurement: Forced expiratory volume/Forced vital capacity (FEV1 / FVC)] [Value: > 70% of predicted];